Clinical trial inclusion criterion:
Be able to give informed consent and comply with study guidelines

Annotated entities:
- Informed_consent: "Be able to give informed consent and comply with study guidelines"